Clinical trial exclusion criterion:
Body Mass Index > 40;

Annotated entities:
- Measurement: "Body Mass Index"
- Value: "> 40"